Clinical trial exclusion criterion:
8. Have met DSM V criteria for moderate to severe substance use disorder (excluding nicotine, alcohol and cannabis) in the past, or have met DSM V criteria for moderate to severe substance use disorder for cannabis or alcohol in the past 5 years.

Annotated entities:
- Parsing_Error: "8."
- Measurement: "DSM V criteria"
- Value: "met"
- Qualifier: "moderate to severe"
- Condition: "substance use disorder"
- Drug: "nicotine"
- Drug: "alcohol"
- Drug: "cannabis"
- Negation: "excluding"
- Temporal: "in the past"
- Measurement: "DSM V criteria"
- Value: "met"
- Qualifier: "moderate to severe"
- Condition: "substance use disorder"
- Drug: "cannabis"
- Drug: "alcohol"
- Temporal: "in the past 5 years"